Current or past psychosis

The above is a clinical trial exclusion criterion. Annotated with entity spans:
[Temporal: Current] or [Temporal: past] [Condition: psychosis]